16) Presence of non-MR compatible implants, pregnancy or severe claustrophobia.

The above is a clinical trial exclusion criterion. Annotated with entity spans:
[Parsing_Error: 16)] Presence of [Device: non-MR compatible implants], [Condition: pregnancy] or [Qualifier: severe] [Condition: claustrophobia].